海馬（hippocampus）最主要之傳入纖維（afferent fiber）來自何處？
A. 內鼻皮質（entorhinal cortex）
B. 扣帶迴（cingulate gyrus）
C. 杏仁核（amygdala）
D. 韁核（habenular nucleus）

正確答案：A. 內鼻皮質（entorhinal cortex）